Seronegative for antibodies against insulin, islet cells and glutamic acid decarboxylase (GAD);

The above is a clinical trial inclusion criterion. Annotated with entity spans:
[Negation: Seronegative] for [Condition: antibodies] against [Qualifier: insulin], [Qualifier: islet cells] and [Qualifier: glutamic acid decarboxylase (GAD)];